Un avance fundamental de la gestión tuvo lugar mediante la creación, por un equipo de la Universidad de Yale, de un sistema de clasificación de episodios de hospitalización, a los cuales se les denominó:
1. Clasificación Internacional de Enfermedades (CIE).
2. Conjunto Mínimo de Datos Básicos (CMDB).
3. Registro de Tiempos Médicos y Quirúrgicos (RTMQ).
4. Grupo de Diagnósticos Relacionados (GDR).
5. Estructura Funcional Quirúrgica-Médica (EFQM).

Respuesta correcta: 4. Grupo de Diagnósticos Relacionados (GDR).